下列那一種麻醉性氣體具有相對較大的最低肺泡濃度（Minimal alveolar concentration）？
A. Halothane
B. Enflurane
C. Nitric oxide
D. Ether

正確答案：C. Nitric oxide